Patient eligible for transradial and transfemoral primary percutaneous coronary intervention, being pre-requisites: (a) familiarity of the operator with the radial and femoral techniques using vascular closure devices, (b) agreement of the operator to use the access route determined by the randomization process.

The above is a clinical trial inclusion criterion. Annotated with entity spans:
Patient [Mood: eligible for] [Qualifier: transradial] and [Qualifier: transfemoral] [Qualifier: primary] [Procedure: percutaneous coronary intervention], [Non-representable: being pre-requisites: (a) familiarity of the operator with the radial and femoral techniques using vascular closure devices, (b) agreement of the operator to use the access route determined by the randomization process.]